La reacción de 4-cloropiridina con etóxido de sodio en etanol origina:
1. 4-Etoxipiridina.
2. 4-Cloro-2-etoxipiridina.
3. No hay reacción.
4. 4-Etoxipiridina y 3-etoxipiridina (mezcla equimolecular).

Respuesta correcta: 1. 4-Etoxipiridina.